fingolimod,

The above is a clinical trial inclusion criterion. Annotated with entity spans:
[Drug: fingolimod],